Clinical trial exclusion criterion:
Any antibiotic intake 7 days prior to blood collection.

Annotated entities:
- Drug: "antibiotic"
- Temporal: "7 days prior to blood collection"
- Reference_point: "blood collection"